Clinical trial inclusion criterion:
Platelets > 50,000

Annotated entities:
- Measurement: "Platelets"
- Value: "> 50,000"